Clinical trial exclusion criterion:
13. Concomitant treatment with other experimental compounds

Entity relations:
- Has_temporal("experimental compounds", "Concomitant")